La cantidad mínima de estimulación auditiva necesaria para comenzar a identificar la letra de un tema musical constituye un umbral:
1. Absoluto.
2. Subliminal.
3. Diferencial.
4. Relativo.
5. Musical.

Respuesta correcta: 1. Absoluto.